Hypertensive (>160/100 mmHg)

The above is a clinical trial exclusion criterion. Annotated with entity spans:
[Condition: Hypertensive] ([Value: >160/100 mmHg])